Clinical trial exclusion criterion:
Subject participated in an investigational drug study within 30 days prior to Visit 1

Annotated entities:
- Observation: "participated in an investigational drug study"
- Temporal: "within 30 days prior to Visit 1"
- Reference_point: "Visit 1"